Clinical trial exclusion criterion:
Current diagnosis of heart failure (New York Heart Association (NYHA) Class II-IV)

Annotated entities:
- Condition: "heart failure"
- Measurement: "New York Heart Association (NYHA) Class"
- Value: "II-IV"